一個公共衛生計畫如果希望達到最起碼的「理性」標準，下列那一個步驟是不可缺少的？
A. 列舉可以測量的政策目標（target）
B. 列舉價值性的政策目標
C. 進行人民的健康需要評估
D. 列舉不同的政策替選方案

正確答案：A. 列舉可以測量的政策目標（target）